Provides a signed copy of the consent form

The above is a clinical trial inclusion criterion. Annotated with entity spans:
[Non-query-able: Provides a signed copy of the consent form]